Clinical trial exclusion criterion:
Family history of ARF

Annotated entities:
- Condition: "ARF"
- Observation: "Family history"